extensive lysis of adhesions

The above is a clinical trial exclusion criterion. Annotated with entity spans:
[Qualifier: extensive] [Condition: lysis of adhesions]